Clinical trial inclusion criteria:
Scheduled to undergo bilateral palatine tonsillectomy as the only procedure

Annotated entities:
- Mood: "Scheduled to undergo"
- Qualifier: "bilateral"
- Procedure: "palatine tonsillectomy"
- Multiplier: "only procedure"
- Procedure: "procedure"